一位 52 歲女性，在急診處被發現血鉀 7.2 mmol/L，其心電圖出現高的 T 波，QRS 延長。第一步需要給予何種處理？
A. 給予 calcium gluconate 靜脈注射
B. 給予 β2-交感神經促進劑（β2-adrenergic agonists）
C. 給予離子交換劑（cation exchange resins）
D. 給予 insulin 加葡萄糖靜脈輸注

正確答案：A. 給予 calcium gluconate 靜脈注射